Clinical trial exclusion criterion:
Evidence of gastrointestinal bleeding

Entity relations:
- AND("Evidence of", "gastrointestinal bleeding")